下列何種手術是耳硬化症（otosclerosis）之治療方法？
A. 耳膜成形術（myringoplasty）
B. 修正式乳突切除術（modified radical mastoidectomy）
C. 鐙骨切除術（stapedectomy）併人工鐙骨置放術
D. 頂鼓室鑿開術（atticotomy）

正確答案：C. 鐙骨切除術（stapedectomy）併人工鐙骨置放術